What is the name of the Cas13 based diagnostic test for the Zika and dengue viruses?

The Cas13-based platform that can detect Zika and dengue viruses is called SHERLOCK (specific high-sensitivity enzymatic reporter unlocking).